Clinical trial inclusion criterion:
toxicity or intolerance if receiving a boosted-protease inhibitor regimen at screening (with plasma HIV RNA < 400 copies/mL at screening)

Annotated entities:
- Condition: "toxicity"
- Condition: "intolerance"
- Procedure: "boosted-protease inhibitor regimen"
- Drug: "protease inhibitor"
- Temporal: "at screening"
- Measurement: "plasma HIV RNA"
- Value: "< 400 copies/mL"
- Temporal: "at screening"